Clinical trial exclusion criterion:
Late diabetic complications as retinopathy, renal insufficiency, neuropathy or previous pancreatitis.

Annotated entities:
- Condition: "Late diabetic complications"
- Condition: "retinopathy"
- Condition: "renal insufficiency"
- Condition: "neuropathy"
- Condition: "pancreatitis"
- Temporal: "previous"